Gastroscopy planned at the same time.

The above is a clinical trial exclusion criterion. Annotated with entity spans:
[Procedure: Gastroscopy] [Mood: planned] [Temporal: at the same time].